施行腋下淋巴結廓清手術時，傷到那條神經，會造成上臂內側麻木或疼痛？
A. 長胸神經（long thoracic nerve）
B. 胸背神經（thoracodorsal nerve）
C. 肋間臂神經（intercostal brachial nerve）
D. 胸肌神經（pectoral nerve）

正確答案：C. 肋間臂神經（intercostal brachial nerve）